Clinical trial inclusion criterion:
Person was never fitted with microprocessor controlled prosthetic knee joint.

Entity relations:
- Has_qualifier("prosthetic knee joint", "microprocessor controlled")
- Has_negation("prosthetic knee joint", "never")